Clinical trial exclusion criterion:
Endocrine disorders such as primary aldosteronism, pheochromocytoma, hyper- or hypothyroidism, insulin-dependent diabetes mellitus

Annotated entities:
- Condition: "Endocrine disorders"
- Condition: "primary aldosteronism"
- Condition: "pheochromocytoma"
- Condition: "hypothyroidism"
- Condition: "hyper thyroidism"
- Qualifier: "insulin-dependent"
- Condition: "diabetes mellitus"